Clinical trial exclusion criterion:
Prior treatment with a bisphosphonate

Entity relations:
- Has_temporal("bisphosphonate", "Prior")